Which gene is responsible for the Liebenberg syndrome?

Liebenberg syndrome is caused by a deletion upstream to the PITX1 gene resulting in transformation of the upper limbs to reflect lower limb characteristics The deleted region is upstream to the PITX1 gene.